有關腦部神經膠質瘤（glioma）之敘述，下列何者錯誤？
A. 小腦毛細胞星形細胞瘤（pilocytic astrocytoma）主要治療方法為切片後放射線治療
B. 寡樹突神經膠細胞瘤（oligodendroglioma）主要治療方式為	量切除後化療
C. 多形性神經膠質母細胞瘤（glioblastoma multiforme）為最常見之神經膠質瘤
D. 多形性神經膠質母細胞瘤（glioblastoma multiforme）治療方法為盡可能完全切除加上放射線治療與

正確答案：A. 小腦毛細胞星形細胞瘤（pilocytic astrocytoma）主要治療方法為切片後放射線治療